Psychiatric diseases; Severe endocrinopathies;

The above is a clinical trial exclusion criterion. Annotated with entity spans:
[Condition: Psychiatric diseases]; [Qualifier: Severe] [Condition: endocrinopathies];